Anaphylactic reaction to a previous dose of TIV(trivalent influenza vaccine)

The above is a clinical trial exclusion criterion. Annotated with entity spans:
[Condition: Anaphylactic reaction] to a previous dose of [Drug: TIV]([Drug: trivalent influenza vaccine])